Terfenadine 若合併下列何種藥物使用， 容易產生心室性心律不整（ventricular arrhythmias）？
A. Carbachol
B. Erythromycin
C. Scopolamine
D. Loratadine

正確答案：B. Erythromycin